Clinical trial exclusion criterion:
Evidence of oral distant metastasis or other malignancies

Annotated entities:
- Qualifier: "distant"
- Qualifier: "oral"
- Condition: "metastasis"
- Qualifier: "other"
- Condition: "malignancies"